Mixed phenotype acute leukemia (MPAL)

The above is a clinical trial exclusion criterion. Annotated with entity spans:
[Condition: Mixed phenotype acute leukemia] ([Condition: MPAL])